Clinical trial inclusion criterion:
Spontaneously ovulating women

Annotated entities:
- Condition: "Spontaneously ovulating"
- Person: "women"